Los cuerpos cetónicos:
1. Son utilizados por el hígado para sintetizar ácidos grasos.
2. Únicamente se forman en condiciones de buena alimentación.
3. Su formación es especialmente activa en músculo esquelético.
4. Se forma a partir de acetil-CoA.
5. Nunca dan acetona.

Respuesta correcta: 4. Se forma a partir de acetil-CoA.